脊髓損傷的病人可採用電極取精之方式協助取得精液，電極要置於何處？
A. 腹部
B. 會陰
C. 直腸
D. 陰莖

正確答案：C. 直腸